Clinical trial exclusion criterion:
Women with multi-fetal pregnancy, diabetes mellitus, chronic hypertension, or chronic renal disease

Annotated entities:
- Person: "Women"
- Condition: "multi-fetal pregnancy"
- Condition: "diabetes mellitus"
- Condition: "chronic hypertension"
- Condition: "chronic renal disease"